Clinical trial inclusion criterion:
Normal S-creatinine before surgery

Entity relations:
- Has_value("S-creatinine", "Normal")
- multi("surgery", "surgery")
- Has_index("before surgery", "surgery")
- Has_temporal("S-creatinine", "before surgery")